一位後天免疫缺乏症候群（AIDS）的病人，發病多年後出現手腳麻感無力等神經病變症狀，下列何種電學診斷方法最具臨床診斷價值？
A. 神經傳導檢查（nerve conduction study）
B. 針肌電圖（needle electromyography）檢查
C. 連續電刺激神經檢查（repetitive nerve stimulation test）
D. 神經誘發電位檢查（evoked potential study）

正確答案：A. 神經傳導檢查（nerve conduction study）